Clinical trial exclusion criterion:
Evidence of significant physical illness contraindicating the use of levomilnacipran and duloxetine found on the physical exam or in the laboratory data obtained during the first week of the study

Annotated entities:
- Condition: "physical illness"
- Condition: "contraindicating"
- Drug: "levomilnacipran"
- Drug: "duloxetine"
- Procedure: "physical exam"
- Procedure: "laboratory"
- Temporal: "during the first week of the study"